下列有關脊神經及支配的肌肉配對，何者錯誤？
A. C5－deltoid muscle
B. C6－triceps muscle
C. L3－quadriceps muscle
D. S1－gastronemius muscle

正確答案：B. C6－triceps muscle